下列何者不是細胞趨化激素？
A. IL-2
B. IL-8
C. Leukotriene B4（LTB4）
D. MCP-1（CCL2）

正確答案：A. IL-2